The patients have active infections that were not suitable for chemotherapy;

The above is a clinical trial exclusion criterion. Annotated with entity spans:
The patients have [Temporal: active] [Condition: infections] that were [Negation: not] [Qualifier: suitable for chemotherapy];